Patients known to be colonized with Methicillin-resistant S. aureus (MRSA)(unethical not to administer glycopeptides), beta-lactam or vancomycin allergy precluding the use of cefazolin or vancomycin, respectively, or to silver precluding the use of Prevena

The above is a clinical trial exclusion criterion. Annotated with entity spans:
Patients known to be [Condition: colonized] with [Qualifier: Methicillin-resistant S. aureus (MRSA)][Non-representable: (unethical not to administer glycopeptides)], [Drug: beta-lactam] or [Drug: vancomycin] [Condition: allergy] precluding the use of [Drug: cefazolin] or [Drug: vancomycin], respectively, or to [Drug: silver] precluding the use of Prevena